Clinical trial exclusion criterion:
Active medical conditions with known mood changes (endocrine, autoimmune disorders).

Annotated entities:
- Non-query-able: "Active medical conditions with known mood changes"
- Condition: "endocrine disorders"
- Condition: "autoimmune disorders"